Clinical trial exclusion criterion:
Uncontrolled diabetes mellitus

Annotated entities:
- Condition: "diabetes mellitus"
- Qualifier: "Uncontrolled"